Clinical trial exclusion criterion:
Patients with clinically significant ECG or laboratory abnormalities

Annotated entities:
- Condition: "laboratory abnormalities"
- Condition: "ECG abnormalities"
- Procedure: "laboratory"
- Procedure: "ECG"
- Qualifier: "clinically significant"